Patients refuse to follow the research

The above is a clinical trial exclusion criterion. Annotated with entity spans:
Patients [Observation: refuse to follow the research]